Clinical trial inclusion criteria:
All adult patients with chronic myeloid leukaemia in any phase (chronic, accelerated or blastic) who undergo allogeneic stem cell transplantation between 01/01/2010 and 30/09/2013 and have been previously treated with Nilotinib or Dasatinib, regardless of their response to these drugs.

Annotated entities:
- Condition: "chronic myeloid leukaemia"
- Procedure: "allogeneic stem cell transplantation"
- Temporal: "between 01/01/2010 and 30/09/2013"
- Drug: "Nilotinib"
- Drug: "Dasatinib"
- Temporal: "previously"
- Qualifier: "chronic"
- Qualifier: "accelerated"
- Qualifier: "blastic"
- Qualifier: "any phase"
- Person: "adult"